Clinical trial exclusion criterion:
Clinical diagnosis of chronic or acute alcoholism

Annotated entities:
- Qualifier: "Clinical diagnosis"
- Qualifier: "acute"
- Qualifier: "chronic"
- Condition: "alcoholism"